若潮氣容積為 450 毫升，無效腔為 150 毫升，每分鐘的呼吸頻率為 12 次，則每分鐘肺泡的通氣量  （alveolar ventilation）為多少毫升？
A. 1800
B. 3600
C. 5400
D. 7200

正確答案：B. 3600